6. Laboratory parameters for vital functions should be in the normal range. Laboratory abnormalities that are not clinically significant are generally permitted, except for the following laboratory parameters, which must be within the ranges specified, regardless of clinical significance:

The above is a clinical trial inclusion criterion. Annotated with entity spans:
[Parsing_Error: 6.] [Measurement: Laboratory parameters for vital functions] should be in the [Value: normal range]. Laboratory abnormalities that are not clinically significant are generally permitted, except for the following laboratory parameters, which must be within the ranges specified, regardless of clinical significance: